Clinical trial inclusion criterion:
Being treated for hypercholesterolemia Being treated for hypertension Being treated for diabetes mellitus Being treated for peripheral vascular disease

Entity relations:
- AND("treated for hypercholesterolemia", "hypercholesterolemia")
- AND("treated for hypertension", "hypertension")
- AND("treated for diabetes mellitus", "diabetes mellitus")
- AND("treated for peripheral vascular disease", "peripheral vascular disease")
- OR("treated for hypercholesterolemia", "treated for hypertension", "treated for diabetes mellitus", "treated for peripheral vascular disease")